有關 Long-term potentiation 的敘述，何者錯誤？
A. 是一種與學習及記憶有關的機制
B. 會導致 action potential 的 amplitude 增大
C. 其機轉可能與 NMDA receptor 有關
D. 會強化 synaptic transmission

正確答案：B. 會導致 action potential 的 amplitude 增大